diagnosis of schizophrenia or presence of thought disorder symptoms

The above is a clinical trial exclusion criterion. Annotated with entity spans:
diagnosis of [Condition: schizophrenia] or presence of [Condition: thought disorder] [Mood: symptoms]